What syndrome is associated with mutations in lysine methyltransferase 2D KMT2D?

Kabuki syndrome (KS) is commonly caused by mutations in the histone-modifying enzyme lysine methyltransferase 2D (KMT2D).